aged 20 years or greater

The above is a clinical trial inclusion criterion. Annotated with entity spans:
[Person: aged] [Value: 20 years or greater]